Clinical trial inclusion criterion:
women in the reproductive period must be completely contraception in 28 days before treatment, during the treatment process and in 28 days after treatment;

Annotated entities:
- Person: "women"
- Observation: "reproductive period"
- Procedure: "contraception"
- Temporal: "in 28 days before treatment"
- Reference_point: "treatment"
- Temporal: "during the treatment process"
- Temporal: "in 28 days after treatment"
- Reference_point: "treatment"
- Reference_point: "treatment"